Clinical trial exclusion criterion:
Consumption of daily medications that alter glucose metabolism of GI function (glucocorticoids, psychotropics, narcotics, metoclopramide)

Annotated entities:
- Multiplier: "daily"
- Drug: "medications"
- Qualifier: "that alter glucose metabolism of GI function"
- Drug: "glucocorticoids"
- Drug: "psychotropics"
- Drug: "metoclopramide"
- Drug: "narcotics"